3-17 years

The above is a clinical trial inclusion criterion. Annotated with entity spans:
[Person: 3-17 years]